Clinical trial exclusion criteria:
Decompensated heart failure or hemodynamic instability
Prior coronary revascularization (PCI or CABG) or myocardial infarction (as evidenced by previously elevated CPK-MB or troponin levels)
Accelerating angina or unstable angina
Inability to physically tolerate MRI or implanted objects that are MRI incompatible
Inability to provide written informed consent obtained at time of study enrollment.
Severe claustrophobia
Advanced heart block or sinus node dysfunction
Hypersensitivity or allergic reaction to regadenoson or adenosine
Hypotension
Active bronchospasm or history of hospitalization due to bronchospasm
History of seizures
Recent cerebrovascular accident
Use of dipyridamole within the last 5 days
Contraindication to aminophylline
Severe renal insufficiency with estimated glomerular filtration rate <30 ml/min/ 1.73 m2
Pregnant or nursing

Annotated entities:
- Qualifier: "Decompensated"
- Condition: "heart failure"
- Condition: "hemodynamic instability"
- Temporal: "Prior"
- Condition: "coronary revascularization"
- Procedure: "PCI"
- Procedure: "CABG"
- Condition: "myocardial infarction"
- Measurement: "CPK-MB levels"
- Measurement: "troponin levels"
- Value: "elevated"
- Temporal: "previously"
- Condition: "Accelerating angina"
- Condition: "unstable angina"
- Condition: "Inability to physically tolerate"
- Procedure: "MRI"
- Device: "implanted objects"
- Qualifier: "MRI incompatible"
- Informed_consent: "Inability to provide written informed consent obtained at time of study enrollment."
- Qualifier: "Severe"
- Condition: "claustrophobia"
- Condition: "sinus node dysfunction"
- Condition: "heart block"
- Qualifier: "Advanced"
- Condition: "Hypersensitivity"
- Condition: "allergic"
- Drug: "regadenoson"
- Drug: "adenosine"
- Condition: "Hypotension"
- Qualifier: "Active"
- Condition: "bronchospasm"
- Temporal: "history"
- Procedure: "hospitalization"
- Condition: "bronchospasm"
- Temporal: "History"
- Condition: "seizures"
- Temporal: "Recent"
- Condition: "cerebrovascular accident"
- Drug: "dipyridamole"
- Temporal: "within the last 5 days"
- Condition: "Contraindication"
- Drug: "aminophylline"
- Qualifier: "Severe"
- Condition: "renal insufficiency"
- Measurement: "estimated glomerular filtration rate"
- Value: "<30 ml/min/ 1.73 m2"
- Condition: "Pregnant"
- Condition: "nursing"